下列何者不是建立良好醫病關係之溝通技巧？
A. 積極傾聽（active listening）
B. 同理心（empathy）
C. 同情心（sympathy）
D. 非語言溝通（non-verbal communication）

正確答案：C. 同情心（sympathy）